下面那一種病毒不含反轉錄酶（reverse transcriptase）？
A. 愛滋病病毒
B. B 型肝炎病毒
C. 人類 T 淋巴細胞病毒（Human T-lymphotropic virus）
D. 小兒麻痺症病毒（Poliovirus）

正確答案：D. 小兒麻痺症病毒（Poliovirus）